Clinical trial exclusion criterion:
History of drug or alcohol abuse within recent 1 year

Annotated entities:
- Temporal: "History"
- Condition: "drug abuse"
- Condition: "alcohol abuse"
- Temporal: "within recent 1 year"